What is the preferred orientation of CTCF binding sites for chromatin looping?

As recently reported, our data also suggest that chromatin loops preferentially form between CTCF binding sites oriented in a convergent manner CRISPR Inversion of CTCF Sites Alters Genome Topology and Enhancer/Promoter Function.